Paciente de 66 años diagnosticado de adenocarcinoma de páncreas estadio IV hace 8 meses. Sigue tratamiento con morfina de liberación retardada 200 mg/12 horas vía oral, ibuprofeno 600 mg/6 horas vía oral, parafina y lactulosa. Desde hace 15 días refiere parestesias y dolor lancinante ocasional en zona lumbar derecha y periumbilical que no cede con ingesta de morfina de rescate. La exploración neurológica es normal. Señale cuál sería el manejo más apropiado:
1. Realizar tomografía axial computarizada y evaluar compresión nerviosa ya que se trata de dolor neuropático.
2. Valorar tratamiento neurolítico ya que el dolor neuropático es de difícil control.
3. Disminuir la dosis de morfina ya que es ineficaz en este tipo de dolor.
4. Administrar amitriptilina o gabapentina, dexametosona y aumentar la dosis de morfina.

Respuesta correcta: 4. Administrar amitriptilina o gabapentina, dexametosona y aumentar la dosis de morfina.